一位 50 歲的先生，被診斷為亨丁頓氏舞蹈症（Huntington chorea），但不肯讓其主治醫師告訴其女兒有關此病之基因資訊。理由是他女兒就算知道自己遺傳了亨丁頓氏舞蹈症之基因，目前也無藥可治，無法改變將來發病之事實。主治醫師勸說無效後，終於沒告訴其女兒，這是因為遵守下列那一項醫學倫理的原則？
A. 病人自主原則（Autonomy）
B. 不傷害原則（Non-maleficence）
C. 行善原則（Beneficence）
D. 公平正義原則（Justice）

正確答案：A. 病人自主原則（Autonomy）